Clinical trial exclusion criterion:
Diabetes or high blood sugar diagnosed by a doctor

Entity relations:
- OR("Diabetes", "high blood sugar")